Stented lesion

The above is a clinical trial exclusion criterion. Annotated with entity spans:
[Device: Stented] [Condition: lesion]